Clinical trial inclusion criterion:
ASA 1 & 2

Entity relations:
- Has_value("ASA", "1 & 2")